2) stroke within the past 6 to 60 months,

The above is a clinical trial inclusion criterion. Annotated with entity spans:
[Parsing_Error: 2)] [Condition: stroke] [Temporal: within the past 6 to 60 months],